The expected survival> 3 months;

The above is a clinical trial inclusion criterion. Annotated with entity spans:
The [Observation: expected survival][Value: > 3 months];